一位 70 歲男性患者，因多年來有運動時呼吸困難現象，前來醫院就診。就診時沒有發燒，身體檢查發現兩手有杵狀指且聽診時可聽到兩側下肺野有細囉音（fine crackles），下列何種疾病最有可能？
A. 肺炎
B. 彌漫性肺部纖維化
C. 肺癌
D. 肺結核

正確答案：B. 彌漫性肺部纖維化